Clinical trial inclusion criterion:
Incipient and established diabetic nephropathy (urinary albumin excretion ≥ 100 mg/day but ≤ 2000 mg/day).

Annotated entities:
- Condition: "diabetic nephropathy"
- Value: "≤ 2000 mg/day"
- Value: "≥ 100 mg/day"
- Measurement: "urinary albumin excretion"